What drug, used to treat rheumatoid arthritis, is an interleukin-1 receptor antagonist?

Anakinra is an orally administered interleukin-1 receptor antagonist that is used to treat rheumatoid arthritis.